Clinical trial exclusion criteria:
Not pregnant
Not seeking medication abortion
Under the age of 15
Contraindications for medication abortion

Annotated entities:
- Condition: "pregnant"
- Procedure: "medication abortion"
- Person: "age"
- Value: "Under 15"
- Condition: "Contraindications"
- Procedure: "medication abortion"